With which cancers has the loss of SMARCB1 been associated?

We therefore sought to identify novel mutations to better understand chordoma biology and to potentially identify therapeutic targets Genotyping cancer-associated genes in chordoma identifies mutations in oncogenes and areas of chromosomal loss involving CDKN2A, PTEN, and SMARCB1